being treated with a beta-blocker

The above is a clinical trial exclusion criterion. Annotated with entity spans:
being [Procedure: treated] with a [Drug: beta-blocker]